Clinical trial exclusion criterion:
History of hypersensitivity for bevacizumab.

Annotated entities:
- Condition: "hypersensitivity"
- Drug: "bevacizumab"
- Temporal: "History"